Tumor equal or below 10 cm from the anal verge, candidates to (ETM) low anterior resection and anastomosis, with or without preoperative chemo-radiotherapy.

The above is a clinical trial inclusion criterion. Annotated with entity spans:
[Condition: Tumor] [Qualifier: equal or below 10 cm from the anal verge], [Mood: candidates] to (ETM) [Procedure: low anterior resection] and anastomosis, with or without [Temporal: preoperative] [Procedure: chemo-radiotherapy].